Clinical trial exclusion criteria:
More than three doses of any opioid within one week of surgery
Pregnancy
Prisoners
Unable to provide consent
Emergency surgery
Chronic kidney disease stage 5 (GFR < 15 ml/min)
Severe hepatic impairment
Recent myocardial infarction (within the last 3 months)

Annotated entities:
- Multiplier: "More than three doses"
- Drug: "opioid"
- Temporal: "within one week of surgery"
- Reference_point: "surgery"
- Condition: "Pregnancy"
- Person: "Prisoners"
- Informed_consent: "Unable to provide consent"
- Procedure: "Emergency surgery"
- Condition: "Chronic kidney disease"
- Qualifier: "stage 5"
- Measurement: "GFR"
- Value: "< 15 ml/min)"
- Condition: "hepatic impairment"
- Qualifier: "Severe"
- Condition: "myocardial infarction"
- Temporal: "the last 3 months"